Patients who require endotracheal intubation without sedative medication. For example, patients in full cardiac arrest.

The above is a clinical trial exclusion criterion. Annotated with entity spans:
Patients who [Observation: require] [Procedure: endotracheal intubation] [Negation: without] [Drug: sedative medication]. For example, patients in [Condition: full cardiac arrest].